Clinical trial exclusion criterion:
Patients with a history of coronary artery disease, valvular or hypertensive heart disease

Entity relations:
- Has_temporal("coronary artery disease", "history")
- OR("coronary artery disease", "heart disease valvular", "hypertensive heart disease")